Age = 50

The above is a clinical trial inclusion criterion. Annotated with entity spans:
[Person: Age] [Value: = 50]